Clinical trial exclusion criterion:
Uterine abnormalities.

Annotated entities:
- Condition: "Uterine abnormalities"